Clinical trial exclusion criterion:
20. Examinations (physical examination, X-ray examination, type-B ultrasonic detection or other methods) reveal that the subject has malignant mass, gland hyperplasia or adenoma with endocrine activity, or impact on heart, or endocrine function (such as pheochromocytoma, thyroid enlargement);

Annotated entities:
- Procedure: "physical examination"
- Procedure: "X-ray examination"
- Procedure: "type-B ultrasonic detection"
- Procedure: "other methods"
- Procedure: "Examinations"
- Undefined_semantics: "Examinations"
- Condition: "malignant mass"
- Condition: "gland hyperplasia"
- Condition: "adenoma"
- Condition: "endocrine activity"
- Qualifier: "with endocrine activity"
- Condition: "pheochromocytoma"
- Condition: "thyroid enlargement"
- Condition: "impact on endocrine function"
- Condition: "impact on heart"